Clinical trial inclusion criterion:
Histopathological verification of glioblastoma multiforme (GBM: WHO grade IV) in remission (Group A) or with active disease (Group B).

Entity relations:
- AND("Histopathological verification", "Histopathological")
- AND("Histopathological verification", "glioblastoma multiforme")
- Has_value("WHO", "grade IV")
- AND("glioblastoma multiforme", "WHO")
- Has_qualifier("Group A", "in remission")
- Has_qualifier("Group B", "with active disease")
- Has_qualifier("glioblastoma multiforme", "Group A")
- Subsumes("glioblastoma multiforme", "GBM")
- Has_temporal("glioblastoma multiforme", "active")
- OR("Group A", "Group B")